Clinical trial inclusion criterion:
Subjects of STEMI who underwent primary PCI within the first 12 hours.

Annotated entities:
- Condition: "STEMI"
- Procedure: "primary PCI"
- Temporal: "within the first 12 hours."